下列有關酒精問題之敘述，何者正確？
A. 酒精性肝病其血清肝臟酵素值通常 ALT（GPT）高於 AST（GOT）
B. 酗酒者其全血球計數（CBC）常顯現小球性紅血球（microcytosis）
C. CAGE 問卷在篩檢酒精問題之實用價值不高
D. 女性飲酒超過建議量時，會增加罹患乳癌之風險

正確答案：D. 女性飲酒超過建議量時，會增加罹患乳癌之風險